-Currently active or previously active inflammatory bowel disease during the 12 months prior to Visit 1 Currently active gastritis, duodenal or gastric ulcers, or gastrointestinal/rectal bleeding during the 3 months prior to Visit 1.

The above is a clinical trial exclusion criterion. Annotated with entity spans:
-[Temporal: Currently active] or [Temporal: previously active] [Condition: inflammatory bowel disease] [Temporal: during the 12 months prior] to Visit 1 [Temporal: Currently active] [Condition: gastritis], [Condition: duodenal] or [Condition: gastric ulcers], or [Condition: gastrointestinal]/[Condition: rectal bleeding] [Temporal: during the 3 months prior] to Visit 1.